喉頭痙攣（laryngospasm）是臨床上相當重要的急性症狀，必須緊急處置。下列關於喉頭痙攣的敘述，何者 錯誤？
A. 喉頭痙攣指的是聲帶（vocal cords）反射性的關閉，有時也會伴隨有假聲帶（false cords）的神經反射性閉
B. 喉頭痙攣的原因多半是因為在麻醉深度不足的情況下，發生手術或咽喉局部刺激所引發的神經性過度反應
C. 喉頭痙攣持續時間通常很短暫，只要誘發的刺激獲得緩解，喉頭痙攣一定可以很快自行消失痊癒
D. 負壓肺水腫（negative-pressure pulmonary edema）是喉頭痙攣嚴重的併發症之一，除了肺間質

正確答案：C. 喉頭痙攣持續時間通常很短暫，只要誘發的刺激獲得緩解，喉頭痙攣一定可以很快自行消失痊癒